Clinical trial exclusion criterion:
Epileptic seizures that are not adequately controlled by Treatment

Annotated entities:
- Condition: "Epileptic seizures"
- Qualifier: "adequately controlled"
- Negation: "not"